Subjects chronically infected with HCV Genotype 1

The above is a clinical trial inclusion criterion. Annotated with entity spans:
Subjects [Temporal: chronically] infected with [Condition: HCV] [Qualifier: Genotype 1]